Clinical trial inclusion criterion:
Any comparable successor IPG (MRI conditional system, BSCI) compatible with

Annotated entities:
- Device: "MRI conditional system"
- Device: "BSCI"
- Device: "successor IPG"
- Qualifier: "comparable"